Clinical trial exclusion criterion:
Judgement by the investigator that the patient is not able to participate in the study

Annotated entities:
- Subjective_judgement: "Judgement by the investigator that the patient is not able to participate in the study"
- Non-query-able: "Judgement by the investigator that the patient is not able to participate in the study"